Critical limb ischemia (Rutherford category 4 or 5)

The above is a clinical trial inclusion criterion. Annotated with entity spans:
[Qualifier: Critical] [Condition: limb ischemia] ([Measurement: Rutherford category] [Value: 4 or 5])